Clinical trial exclusion criterion:
Concurrent participation in another clinical trial of an investigational medicinal product.

Annotated entities:
- Competing_trial: "Concurrent participation in another clinical trial of an investigational medicinal product"